Clinical trial exclusion criterion:
Have been treated with exogenous insulin for more than 1 week within the 3 months prior to screening.

Annotated entities:
- Drug: "exogenous insulin"
- Multiplier: "for more than 1 week"
- Temporal: "within the 3 months prior to screening"
- Reference_point: "screening"